Clinical or laboratory evidence of systemic infection

The above is a clinical trial exclusion criterion. Annotated with entity spans:
[Undefined_semantics: Clinical or laboratory evidence of systemic infection]